SCI above L5

The above is a clinical trial inclusion criterion. Annotated with entity spans:
[Measurement: SCI] [Value: above L5]